以下何項並非USPSTF（US Preventive Services Task Force）所強烈建議（class A）的癌症篩檢方式？
A. 針對40～49歲女性每兩年接受乳房攝影（mammography）
B. 針對21～65歲女性每三年接受子宮頸抹片（Pap test）
C. 針對50～75歲成人每年接受糞便潛血檢測（fecal occult blood testing）
D. 針對50～75歲成人每十年接受大腸鏡檢查（colonoscopy）

正確答案：A. 針對40～49歲女性每兩年接受乳房攝影（mammography）